What is formin associated with in the snail?

Formin Is Associated with Left-Right Asymmetry in the Pond Snail and the Frog